Myoma.

The above is a clinical trial exclusion criterion. Annotated with entity spans:
[Condition: Myoma].